那些情形不會影響 Pulse oximeter 的準確性？
A. Methemoglobinemia
B. 周圍光線太強
C. 心跳每分鐘 120 次以下
D. 低血流灌注（Low perfusion）

正確答案：C. 心跳每分鐘 120 次以下